Clinical trial inclusion criterion:
Children undergoing ENT surgery under general anaesthesia.

Annotated entities:
- Person: "Children"
- Procedure: "ENT surgery"
- Temporal: "undergoing"
- Procedure: "general anaesthesia"